Diagnosis of HCC

The above is a clinical trial exclusion criterion. Annotated with entity spans:
Diagnosis of [Condition: HCC]